Clinical trial exclusion criterion:
Serious heart insufficiency, liver insufficiency, renal insufficiency and other serious medical problems

Annotated entities:
- Qualifier: "Serious"
- Condition: "heart insufficiency"
- Condition: "liver insufficiency"
- Condition: "renal insufficiency"
- Qualifier: "other"
- Condition: "serious medical problems"